Major medical disorders (e.g., HIV, cancer)

The above is a clinical trial exclusion criterion. Annotated with entity spans:
[Qualifier: Major] [Condition: medical disorders] (e.g., [Condition: HIV], [Condition: cancer])